Clinical trial exclusion criterion:
3. Serious status of illness, such as severe renal failure whose creatinine clearance<30 ml/min, New York Heart Association grade III or grade IV congestive heart failure, or hemodynamic instability, etc.

Annotated entities:
- Parsing_Error: "3."
- Condition: "renal failure"
- Measurement: "creatinine clearance"
- Value: "<30 ml/min"
- Qualifier: "severe"
- Measurement: "New York Heart Association"
- Value: "grade III or grade IV"
- Condition: "congestive heart failure"
- Condition: "hemodynamic instability"
- Undefined_semantics: "Serious status of illness"
- Subjective_judgement: "Serious status of illness"
- Condition: "Serious status of illness"